Clinical trial inclusion criterion:
dNMB with rocuronium during ear nose and throat (ENT) surgery

Entity relations:
- AND("ear nose and throat (ENT) surgery", "dNMB with rocuronium")